下列有關 tamoxifen 的藥理學作用描述，何者錯誤？
A. 為一種為非類固醇的抗雌激素，藉由與雌激素受體結合，進而抑制內生性雌激素作用
B. 廣泛地被使用來治療乳癌患者
C. 使用可導致停經後婦女之血中總膽固醇及低密度脂蛋白濃度升高
D. 具有降低停經後婦女腰椎骨密度降低的風險

正確答案：C. 使用可導致停經後婦女之血中總膽固醇及低密度脂蛋白濃度升高